Clinical trial inclusion criterion:
No signs of infection

Annotated entities:
- Negation: "No"
- Condition: "signs of infection"